下列何者並非新生兒呼吸窘迫（neonatal respiratory distress syndrome）的危險因子之一？
A. 新生兒性別為男性（male gender）
B. 母親於產前有使用類固醇藥物（glucocorticoids）
C. 早產
D. 新生兒種族為白人（white race）

正確答案：B. 母親於產前有使用類固醇藥物（glucocorticoids）